Clinical trial inclusion criteria:
Patients aged 7 years and older must have provided written assent accompanied by written informed consent from patient's representative
Clinical diagnosis of stable plaque psoriasis with involvement of = 10% body surface area (excluding face and scalp)
Physicians Global Assessment score of 3 or 4 at baseline

Annotated entities:
- Person: "aged"
- Value: "7 years and older"
- Post-eligibility: "must have provided written assent accompanied by written informed consent from patient's representative"
- Condition: "plaque psoriasis"
- Qualifier: "stable"
- Measurement: "body surface area"
- Negation: "excluding"
- Condition: "face"
- Condition: "scalp"
- Value: "= 10%"
- Grammar_Error: "and"
- Measurement: "Physicians Global Assessment score"
- Value: "3"
- Value: "4"
- Temporal: "at baseline"